Clinical trial exclusion criterion:
3. Antihypertensives: nifedipine

Annotated entities:
- Parsing_Error: "3."
- Drug: "nifedipine"